De los siguientes tipos de leche: ¿Cuál podría ingerir un individuo alérgico a las proteínas de la leche de vaca?:
1. Leche de cabra.
2. Leche de búfala.
3. Leche de soja.
4. Leche de oveja.

Respuesta correcta: 3. Leche de soja.